How do CYP1A2 polymorphisms affect the habitual coffee consumption effect on apetite?

The CYP1A2 polymorphism -163C > A (rs762551) polymorphism renders carriers:  rapid (AA), intermediate (AC), or slow (CC) caffeine metabolizers.
High coffee consumption was more prevalent in rapid compared to slow metabolizers (P = 0.008 after adjustment for age, sex, and BMI) and was associated with lower appetite perception and lower BMI only in rapid metabolizers (P for interaction of rs762551 genotype*coffee consumption = 0.002 and 0.048, respectively).